Clinical trial exclusion criterion:
epilepsy

Annotated entities:
- Condition: "epilepsy"